Patients who can't come back to clinic for follow-up on schedule.

The above is a clinical trial exclusion criterion. Annotated with entity spans:
[Post-eligibility: Patients who can't come back to clinic for follow-up on schedule].